Clinical trial exclusion criterion:
Neurological Congenital malformations and/or those known to impair intestinal motility

Annotated entities:
- Condition: "Neurological Congenital malformations"
- Condition: "impair intestinal motility"